(4)Voluntarily participates and has signed an informed consent form.

The above is a clinical trial inclusion criterion. Annotated with entity spans:
(4)[Observation: Voluntarily participates] and has [Observation: signed an informed consent] form.